Concurrent medications that affect gastrointestinal motility

The above is a clinical trial exclusion criterion. Annotated with entity spans:
Concurrent [Drug: medications] that affect [Condition: gastrointestinal motility]